Clinical trial exclusion criterion:
Cervical dilation >1.5 cm and/or visible membranes by pelvic exam

Entity relations:
- Has_value("Cervical dilation", ">1.5 cm")
- AND("pelvic exam", "visible membranes")
- OR("Cervical dilation", "pelvic exam")